Clinical trial exclusion criterion:
Patients having clinically significant abnormal laboratory, or ECG findings not resolved by further examinations.

Annotated entities:
- Measurement: "laboratory findings"
- Measurement: "ECG findings"
- Value: "significant abnormal"
- Non-query-able: "not resolved by further examinations"